Clinical trial exclusion criteria:
Known or suspected allergy to trial product(s) or related products
Subjects who are unlikely to comply with protocol requirements, e.g. uncooperative attitude, inability to return for the final visit
Subjects who previously enrolled in this study
Females of childbearing potential who are pregnant, breast-feeding or intend to become pregnant or are not using adequate contraceptive methods
The receipt of any investigational product within 3 months prior to this trial

Annotated entities:
- Condition: "allergy to trial product(s)"
- Condition: "allergy related products"
- Drug: "trial product(s)"
- Drug: "related products"
- Non-query-able: "Subjects who are unlikely to comply with protocol requirements, e.g. uncooperative attitude, inability to return for the final visit"
- Post-eligibility: "Subjects who are unlikely to comply with protocol requirements, e.g. uncooperative attitude, inability to return for the final visit"
- Context_Error: "Subjects who previously enrolled in this study"
- Post-eligibility: "Subjects who previously enrolled in this study"
- Condition: "childbearing potential"
- Person: "Females"
- Condition: "pregnant"
- Condition: "breast-feeding"
- Condition: "pregnant"
- Mood: "intend to become"
- Procedure: "contraceptive methods"
- Qualifier: "adequate"
- Negation: "not"
- Pregnancy_considerations: "Females of childbearing potential who are pregnant, breast-feeding or intend to become pregnant or are not using adequate contraceptive methods"
- Drug: "investigational product"
- Temporal: "within 3 months prior to this trial"
- Reference_point: "this trial"